Clinical trial exclusion criterion:
Treatment with any therapeutically dosed anticoagulant for more than 48 hours prior to enrolment

Annotated entities:
- Drug: "anticoagulant"
- Qualifier: "therapeutically"
- Temporal: "more than 48 hours prior to enrolment"
- Reference_point: "enrolment"